下列有關治療甲狀腺風暴（thyroid storm）的敘述中，何者為適當？
A. 先使用高劑量碘再加入抗甲狀腺藥物
B. 抗甲狀腺藥物以 carbimazole 為首選
C. 避免使用 glucocorticoids
D. 加入 propranolol 治療

正確答案：D. 加入 propranolol 治療